完全型的房室瓣中隔缺損（complete form of atrioventricular septal defect）的病童，常因頑固性的心衰竭，需早期（出生後6個月內）手術治療，其手術步驟包括下列那些？ ①房室瓣狹窄之切開術 ②心房中隔缺損之修補 ③心室中隔缺損之修補 ④房室瓣逆流之修補術
A. 僅①②
B. 僅①③
C. ①②③
D. ②③④

正確答案：D. ②③④